Oral body temperature within the range 35.0-37.5 °C

The above is a clinical trial inclusion criterion. Annotated with entity spans:
[Measurement: Oral body temperature] within the range [Value: 35.0-37.5 °C]